Receiving drugs acting primarily on the central nervous system, which lower the seizure threshold such as antipsychotic drugs (chlorpromazine, clozapine) or tricyclic antidepressants.

The above is a clinical trial exclusion criterion. Annotated with entity spans:
Receiving [Drug: drugs acting primarily on the central nervous system], which [Qualifier: lower the seizure threshold] such as [Drug: antipsychotic drugs] ([Drug: chlorpromazine], [Drug: clozapine]) or [Drug: tricyclic antidepressants].